Eczema, history of eczema, exfoliative skin conditions, wounds, burns, or other skin conditions at the investigator's discretion.

The above is a clinical trial exclusion criterion. Annotated with entity spans:
[Condition: Eczema], [Temporal: history of eczema], [Condition: exfoliative skin conditions], [Condition: wounds], [Condition: burns], or [Condition: other skin conditions] [Subjective_judgement: at the investigator's discretion].